Clinical trial inclusion criterion:
Histologically or cytologically confirmed diagnosis of adenocarcinoma of the colon or rectum.

Entity relations:
- Has_qualifier("adenocarcinoma", "colon")
- Has_value("Histologically", "confirmed")
- AND("adenocarcinoma", "Histologically")
- OR("colon", "rectum")
- OR("Histologically", "cytologically")